Clinical trial exclusion criterion:
Allergy to ropivacaine, bupivacaine, or other local anesthetic agents

Annotated entities:
- Condition: "Allergy"
- Drug: "ropivacaine"
- Drug: "bupivacaine"
- Drug: "local anesthetic agents"